Prior malignancy within the previous 5 years (except for cured skin basal cell carcinoma or cervical carcinoma in situ)

The above is a clinical trial exclusion criterion. Annotated with entity spans:
[Temporal: Prior] [Condition: malignancy] [Temporal: within the previous 5 years] ([Negation: except for] [Condition: cured skin basal cell carcinoma] or [Condition: cervical carcinoma in situ])